Clinical trial inclusion criterion:
Patients diagnosed with primary biliary cholangitis

Annotated entities:
- Condition: "primary biliary cholangitis"